What pathological condition is MK-1602 used for?

MK-1602 has been assessed in clinical trials for the acute treatment of migraine.